Está bien asociado con su función:
1. ARN ribosómico –procesamiento del pre – ARN mensajero.
2. ARN mensajero – unión a aminoácido.
3. Micro ARN – inhibe la traducción del ARN ribosómico.
4. ARN nucleolar pequeño – procesamiento del ARN ribosómico.

Respuesta correcta: 4. ARN nucleolar pequeño – procesamiento del ARN ribosómico.